Please list the 2 vaccines for herpes zoster(shingles)

live attenuated zoster vaccine (Zostavax; also known as shingles vaccine) is effective for prevention of infections with herpes zoster virus (VZV).